Clinical trial inclusion criterion:
Fasting LDL-C =70mg/dL or = 160mg/dL at the randomization visit

Entity relations:
- Has_value("Fasting LDL-C", "=70mg/dL")
- Has_temporal("Fasting LDL-C", "at the randomization visit")
- Has_temporal("Fasting LDL-C", "at the randomization visit")
- OR("=70mg/dL", "= 160mg/dL")